130mmHg=SBP<180mmHg, or 80mmHg=DBP<110mmHg or ongoing anti-hypertensive therapy;

The above is a clinical trial inclusion criterion. Annotated with entity spans:
[Value: 130mmHg]=[Measurement: SBP][Value: <180mmHg], or [Value: 80mmHg=][Measurement: DBP][Value: <110mmHg] or [Temporal: ongoing] [Procedure: anti-hypertensive therapy];